一位 28 歲婦女連續經歷 2 次懷孕初期（＜12 weeks）之胚胎死亡，她曾經有過靜脈栓塞（deep vein thrombosis）之病史。下列何者為必要的評估方式？
A. 測量血小板功能
B. 測量血液中 protein S、protein C、anti-thrombin III 活性
C. 測量血液中 factor V 值
D. 測量血液黏稠度（viscosity）

正確答案：B. 測量血液中 protein S、protein C、anti-thrombin III 活性